Clinical trial exclusion criterion:
habitual opioid consumption;

Entity relations:
- Has_qualifier("opioid consumption", "habitual")